肺臟移植之後，最主要的慢性排斥反應是：
A. 嗜伊紅性白血球浸潤
B. 閉塞性細支氣管炎
C. 肉芽腫
D. 肺動脈粥狀硬化

正確答案：B. 閉塞性細支氣管炎